有一位妊娠32週的孕婦前來接受產前檢查，醫師除了要問診本胎不適症狀、過去孕產史、家庭疾病史及進行身體檢查外，還需要安排實 室檢查。下列那項檢查是此懷孕時程所必需安排的？
A. 甲狀腺功能
B. 葡萄糖-6-磷酸去氫酶（蠶豆症檢查）
C. 口服葡萄糖耐性試
D. B型肝炎表面抗原檢查

正確答案：D. B型肝炎表面抗原檢查